Clinical trial exclusion criterion:
Patients who tool medicine such as PPI, APA,H2blocker, Muscarine receptor antagonist, anti-gastic agent, antacid, anticaogulant, Bisphosphonate agents, Cytotoxic drug, NSAID, adrenal cortex hormone agents (topical treatment is allowed)

Entity relations:
- Has_negation("topical treatment", "allowed")
- OR("PPI", "APA", "H2blocker", "Muscarine receptor antagonist", "anti-gastic agent", "antacid", "anticaogulant", "Bisphosphonate agents", "Cytotoxic drug", "NSAID", "adrenal cortex hormone agents")